Las telomerasas:
1. Usan RNA como cebador para la síntesis de DNA.
2. Están permanentemente activas en las células somáticas.
3. Tienen actividad retrotranscriptasa.
4. Son necesarias para proteger los inicios de replicación.

Respuesta correcta: 3. Tienen actividad retrotranscriptasa.